Alanine 及 2-oxoglutarate 在 alanine aminotransferase 作用下會形成 glutamate 及何者？
A. aspartate
B. oxaloacetate
C. ketobutyrate
D. pyruvate

正確答案：D. pyruvate